Which cancer types are associated with mutations in the TWIST1 gene?

Loss-of-function mutations of TWIST1, a catalytic component of polycomb repressive complex 1 (PRC1), are observed in ~\n10% of patients with gastric, non-small cell lung, breast ductal carcinomas, nonsmall cell lung cancer, prostate cancer, ovarian cancer, breast tumor, papillary thyroid cancer, and gastric cancer.